Clinical trial inclusion criterion:
Pre-operative hemoglobin >8 g/dl

Entity relations:
- multi("operative", "operative")
- AND("Pre-operative", "operative")
- Has_value("hemoglobin", ">8 g/dl")
- Has_temporal("hemoglobin", "Pre-operative")
- Has_index("Pre-operative", "operative")